一位 65 歲病人有十年的糖尿病史和七年的高血壓，半年前因為冠狀動脈疾病住院，做了血管攝影和氣球擴張術。出院時的血壓控制在 130-150/75-85 mmHg，血清肌酸酐是 1.8 mg/dL。近四個月他的血壓控制不理想，約在 165-180/95-110 mmHg；飯前血糖值為 140 mg/dL，血清肌酸酐上升到 3.5 mg/dL。 有關此病人的進一步診斷處理，下列何者比較正確？
A. 可能是腎上腺腫瘤，理學檢查應該特別注意腹部的觸摸
B. 可能是顯影劑引起的腎功能衰退，再觀察三個月看腎功能是否恢復
C. 安排 captopril 腎臟同位素攝影，考慮腎動脈狹窄
D. 這是糖尿病腎病變的惡化過程，應再嚴格控制血糖

正確答案：C. 安排 captopril 腎臟同位素攝影，考慮腎動脈狹窄